下列有關腦神經膠質母細胞瘤 glioblastoma multiforme（GBM）的敘述，何者不正確？
A. 最常見的腦瘤是神經膠質瘤（glioma）
B. 星狀細胞瘤第四級（Astrocytoma, grade 4）
C. 病理切片可見細胞有絲分裂、內皮細胞增生、壞死（mitotic figure、endothelial proliferation、necrosis）
D. 平均生存時間：2 年

正確答案：D. 平均生存時間：2 年